Clinical trial exclusion criterion:
Genetic malignant hyperthermia

Entity relations:
- Has_qualifier("malignant hyperthermia", "Genetic")